What is the mode of inheritance of Wilson's disease?

Wilson's disease (WD) is an autosomal recessive disorder.